Which molecule is targeted by Olaratumab?

Olaratumab is a recombinant human monoclonal antibody that binds to platelet-derived growth factor receptor-α (PDGFRα). It is used for treatment of soft tissue sarcoma.